Progressive neurological disease

The above is a clinical trial exclusion criterion. Annotated with entity spans:
[Qualifier: Progressive] [Condition: neurological disease]